En los inicios del Mundo Cristiano, NO es considerada una característica del cuidado que se llevaba a cabo atender al enfermo como:
1. Un mandato evangélico para los cristianos.
2. Una manera de imitar la vida de Jesús.
3. Una consideración humana relacionada con las actividades de ayuda al enfermo en sus necesidades.
4. Una oportunidad de redención para el enfermo y para quien se la proporciona.
5. Un ser necesitado de asistencia técnicomédica exclusivamente.

Respuesta correcta: 5. Un ser necesitado de asistencia técnicomédica exclusivamente.